E.coli in blood culture

The above is a clinical trial inclusion criterion. Annotated with entity spans:
[Value: E.coli] in [Procedure: blood culture]